一位70歲老年人在2天前跌倒撞到頭後，今天覺得左側無力且嗜睡，在急診的電腦斷層掃描顯示硬腦膜下血腫（subdural hematoma）下列敘述何者錯誤？
A. 可能為中大腦動脈（middle cerebral artery）出血所致
B. 這類病患可能需要手術處理
C. 此類腦出血大多曾有頭部創傷所致
D. 在老年病患有時神經學變化較晚才出現

正確答案：A. 可能為中大腦動脈（middle cerebral artery）出血所致